Clinical trial exclusion criterion:
more than tree fingers involvement

Annotated entities:
- Multiplier: "more than tree"
- Condition: "fingers involvement"